就 ethnomedical cultural model 而言，醫師在看診中可以應用 LEARN 的模式，以增進醫師與病人的溝通互動。下列何者對於 LEARN 的敘述錯誤？
A. listen：以同理心傾聽病人對於其生病的解釋模式
B. explain：以病人所能了解的語言，確定並解釋病人的問題內容
C. assess：評估並確認對病人之診斷與所要執行的處理模式
D. negotiate：與病人討論以取得醫病雙方均可接受的治療共識

正確答案：C. assess：評估並確認對病人之診斷與所要執行的處理模式